What is Hikikomori syndrome?

Hikikomori is a clinical condition in which a subject locks himself/herself into his/her own house for more than 6 months.